Clinical trial exclusion criterion:
Chronic or acute pain requiring prescription pain medication(s) (narcotic or synthetic narcotic)

Annotated entities:
- Qualifier: "acute"
- Qualifier: "Chronic"
- Condition: "pain"
- Drug: "prescription pain medication"
- Drug: "narcotic"
- Drug: "synthetic narcotic"